What is the role of STAG1/STAG2 proteins in differentiation?

involved in the g2-m transition